Patients with second primary cancer, except:adequately treated non-melanoma skin cancer, curatively treated in-situ cancer of the cervix, or other solid tumor curatively treated with no evidence of disease for <= 5 years.

The above is a clinical trial exclusion criterion. Annotated with entity spans:
Patients with [Qualifier: second] [Condition: primary cancer,] [Negation: except]:adequately [Mood: treated] [Condition: non-melanoma skin cancer], curatively [Mood: treated] [Condition: in-situ cancer of the cervix], or other [Non-query-able: solid tumor curatively treated with no evidence of disease for <= 5 years.]